Clinical trial exclusion criterion:
5. ADC Stage > 1.

Entity relations:
- Has_value("ADC Stage", "> 1")